下列何者由上、中咽縮肌間通過？
A. 舌咽神經（glossopharyngeal nerve）
B. 喉內神經（internal laryngeal nerve）
C. 喉上動脈（superior laryngeal artery）
D. 喉返神經（recurrent laryngeal nerve）

正確答案：A. 舌咽神經（glossopharyngeal nerve）